Clinical trial exclusion criterion:
Organic mental disease, including mental retardation.

Annotated entities:
- Condition: "Organic mental disease"
- Condition: "mental retardation"